Clinical trial exclusion criteria:
Traumatic pulmonary contusion or laceration
Lung reduction surgery
Planned removal of more than 10 lung lesions
Pneumonectomy
Known hypersensitivity to bovine protein
Known hypersensitivity to Brilliant Blue FCF (E133)
Presence of active infection

Annotated entities:
- Condition: "pulmonary contusion"
- Condition: "laceration"
- Qualifier: "Traumatic"
- Procedure: "Lung reduction surgery"
- Multiplier: "more than 10"
- Condition: "lung lesions"
- Mood: "Planned"
- Procedure: "removal"
- Procedure: "Pneumonectomy"
- Condition: "hypersensitivity"
- Drug: "bovine protein"
- Condition: "hypersensitivity"
- Drug: "Brilliant Blue FCF (E133)"
- Drug: "Brilliant Blue FCF (E133)"
- Condition: "active infection"